Un paciente asmático de 55 años acude a Urgencias con una agudización. Una hora después de la administración de oxígeno suplementario y dos nebulizaciones de salbutamol el paciente no mejora. A la exploración respira a 42 rpm con tiraje supraclavicular y presenta sibilancias inspiratorias y espiratorias diseminadas. El flujo pico ha bajado de 310 a 220 L/min. Una gasometría extraída con oxígeno al 28% muestra una pO2 de 54 mmHg y una pCO2 de 35 mm Hg. ¿Cuál de las siguientes actitudes le parece MENOS indicada?
1. Aumentar el flujo de oxígeno.
2. Administrar 80 mg de metilprednisolona iv.
3. Nebulizar bromuro de ipratropio junto con salbutamol cada 20 minutos.
4. Administrar magnesio intravenoso.
5. Iniciar ventilación mecánica no invasiva.

Respuesta correcta: 5. Iniciar ventilación mecánica no invasiva.